Un joven de 20 años acude a Urgencias por fiebre de 39ºC, escalofríos, pápulas y pústulas hemorrágicas en las superficies extensoras distales de las extremidades y artritis de la rodilla. ¿Cuál es su diagnóstico de sospecha inicial?
1. Artritis reumatoide.
2. Síndrome de Reiter.
3. Gota úrica.
4. Artritis gonocócica.
5. Vasculitis de Cogan.

Respuesta correcta: 4. Artritis gonocócica.